Clinical trial exclusion criterion:
American Society of Anesthesiologists score (ASA) III or IV

Entity relations:
- Has_value("American Society of Anesthesiologists score (ASA)", "III")
- OR("III", "IV")